Clinical trial exclusion criterion:
Patient allergic to a penicillin or a carbapenem

Annotated entities:
- Condition: "allergic"
- Drug: "penicillin"
- Drug: "carbapenem"